Non-radicular pain. Patients will be excluded if the pain radiates below the gluteal folds in a radicular pattern.

The above is a clinical trial inclusion criterion. Annotated with entity spans:
[Negation: Non]-[Qualifier: radicular] [Condition: pain]. Patients will be [Negation: excluded] if the [Condition: pain] radiates [Qualifier: below the gluteal folds in a radicular pattern].